Patients scheduled for thyroidectomy with general anesthesia in the University of Chile Clinical Hospital

The above is a clinical trial inclusion criterion. Annotated with entity spans:
Patients [Mood: scheduled for] [Procedure: thyroidectomy] with [Procedure: general anesthesia] in the [Visit: University of Chile Clinical Hospita]l